69歲男病患無特殊病史，因嗜睡2天意識不清由女兒帶至急診，經檢查發現有心臟衰竭及二氧化碳堆積情況。 其家屬（兩位女兒）表示不希望給予插管、電擊、壓胸等侵入性治療增加病患痛苦，且當場要簽署「選擇安
 寧緩和醫療同意書」，表示希望給予病患緩和醫療於醫院善終。下列敘述何者最正確？
A. 此病患是末期病人，因此家屬簽署「選擇安寧緩和醫療同意書」是合法的
B. 醫師應以病人最大利益為第一考量，先急救再說
C. 病人意識不清，醫師應以家屬的意願為第一考量
D. 先問醫學倫理委員會再決定

正確答案：B. 醫師應以病人最大利益為第一考量，先急救再說